對於冠狀動脈心臟病之精神科非藥物治療模式中，下列何者較欠缺實證醫學之佐證？
A. 放鬆訓練
B. 壓力管理訓練
C. 團體社會支持
D. 精神分析

正確答案：D. 精神分析